Clinical trial exclusion criterion:
PCOS or polycystic ovary on ultrasound scan.

Entity relations:
- AND("ultrasound scan", "PCOS")
- OR("PCOS", "polycystic ovary")